肱骨內上髁（medial epicondyle）骨折最可能傷害下列何者？
A. 肌皮神經
B. 正中神經
C. 橈神經
D. 尺神經

正確答案：D. 尺神經